Clinical trial inclusion criterion:
Age between 18 and 65 years.

Entity relations:
- Has_value("Age", "between 18 and 65 years")